For HCV-negative, healthy volunteers: History of HCV infection or positive HCV antibody test

The above is a clinical trial exclusion criterion. Annotated with entity spans:
For [Measurement: HCV]-[Value: negative], healthy volunteers: [Temporal: History of HCV infection] or positive HCV antibody test